Current use of any medication, including antiretrovirals, prohibited in the study (refer to the A5324 protocol-specific web page [PSWP] for the prohibited medications)

The above is a clinical trial exclusion criterion. Annotated with entity spans:
[Temporal: Current] use of any [Drug: medication], including [Drug: antiretrovirals], [Qualifier: prohibited in the study] (refer to the A5324 protocol-specific web page [PSWP] for the prohibited medications)